Clinical trial exclusion criterion:
Prior allergic reaction to any type of local anesthetic

Entity relations:
- AND("allergic reaction", "local anesthetic")